Clinical trial inclusion criterion:
English speaking/literate

Annotated entities:
- Post-eligibility: "English speaking/literate"